過去身體都十分健康的46歲男性病人，因為發燒及咳嗽3天到門診就醫，胸部X光檢查有疑似肺炎病灶。下列何者最不可能為致病菌？
A. 肺炎鏈球菌（Streptococcus pneumoniae）
B. 黴漿菌（Mycoplasma pneumoniae）
C. 鮑氏不動桿菌（Acinetobacter baumannii）
D. 嗜血桿菌（Haemophilus influenzae）

正確答案：C. 鮑氏不動桿菌（Acinetobacter baumannii）